Clinical trial exclusion criterion:
The participant has severe dyskinesia.

Annotated entities:
- Condition: "dyskinesia"
- Qualifier: "severe"